Clinical trial inclusion criterion:
Histopathological verification of glioblastoma multiforme (GBM: WHO grade IV) in remission (Group A) or with active disease (Group B).

Annotated entities:
- Condition: "glioblastoma multiforme"
- Procedure: "Histopathological"
- Observation: "Histopathological verification"
- Measurement: "WHO"
- Value: "grade IV"
- Qualifier: "in remission"
- Qualifier: "Group A"
- Qualifier: "Group B"
- Temporal: "active"
- Qualifier: "with active disease"
- Condition: "GBM"